Clinical trial exclusion criterion:
Concomitant participation in another clinical study

Entity relations:
- Has_temporal("participation in another clinical study", "Concomitant")